Clinical trial exclusion criterion:
Expected life span<6-month

Annotated entities:
- Observation: "Expected life span"
- Value: "<6-month"